What happens upon disruption of a TAD boundary?

Disruption of a TAD boundary causes ectopic chromosomal contacts and long-range transcriptional misregulation. This rewiring occurred only if the variant disrupted a CTCF-associated boundary domain.